Sustained or symptomatic ventricular dysrhythmias uncontrolled by drug therapy or the use of an implantable defibrillator, and/or significant cardiac conduction defects, e.g., 2nd degree or 3rd degree AV block, or sick sinus syndrome, unless a functioning pacemaker is in place

The above is a clinical trial exclusion criterion. Annotated with entity spans:
[Qualifier: Sustained] or [Qualifier: symptomatic] [Condition: ventricular dysrhythmias] [Qualifier: uncontrolled by drug therapy] or the use of an [Device: implantable defibrillator], and/or [Qualifier: significant] [Condition: cardiac conduction defects], e.g., [Condition: 2nd degree] or [Condition: 3rd degree AV block], or [Condition: sick sinus syndrome], [Negation: unless] a [Qualifier: functioning] [Device: pacemaker] is in place